下列何者是診斷急性肺傷害引起之急性呼吸窘迫症候群最重要的病理特徵？
A. 透明膜（hyaline membrane）
B. 第二型肺細胞增生（type II pneumocyte proliferation）
C. 肺泡壁及肺泡空腔內肉芽組織（granulation tissue in alveolar wall and spaces）
D. 肺泡中隔纖維化增厚（fibrotic thickening of alveolar septa）

正確答案：A. 透明膜（hyaline membrane）